Clinical trial exclusion criterion:
Clinical diagnosis of hepatic or renal disease

Annotated entities:
- Condition: "renal disease"
- Condition: "hepatic disease"
- Qualifier: "Clinical diagnosis"